下列何者最不常用於吞嚥功能的評估？
A. 理學檢查（physical examination）
B. 動態吞嚥攝影（videofluorographic swallowing study ）
C. 電腦斷層咽喉掃描（CT scan of pharynx）
D. 纖維內視鏡吞嚥檢查（fiberoptic endoscopic examination of swallowing）

正確答案：C. 電腦斷層咽喉掃描（CT scan of pharynx）